有關臺灣現行的新生兒代謝異常篩檢，下列敘述何者錯誤？
A. 剛出生的寶寶需一天內採腳跟血，滴在血片上，送新生兒篩檢中心檢查
B. Tandem mass spectrometry是目前最主要的篩檢工具
C. 篩檢的疾病以胺基酸、有機酸、脂肪酸代謝異常為主
D. 低體重兒、產程有併發症的寶寶比較會有偽陽性（False positive）的結果

正確答案：A. 剛出生的寶寶需一天內採腳跟血，滴在血片上，送新生兒篩檢中心檢查